¿Cuál de las siguientes situaciones favorece la aparición de edema tisular?:
1. Drenaje inadecuado de la linfa por la obstrucción del sistema linfático.
2. Disminución de la presión hidrostática capilar.
3. Aumento de la concentración de proteínas plasmáticas.
4. Disminución de la permeabilidad capilar.

Respuesta correcta: 1. Drenaje inadecuado de la linfa por la obstrucción del sistema linfático.